Clinical trial inclusion criterion:
Patients are of American Society of Anesthesiologists (ASA) physical status I and II, aged 8-14 years old, of both gender, with suspected acute appendicitis scheduled for laparoscopic appendicectomy.

Annotated entities:
- Measurement: "American Society of Anesthesiologists physical status"
- Measurement: "ASA"
- Value: "I and II"
- Person: "aged"
- Value: "8-14 years old"
- Person: "both gender"
- Mood: "suspected"
- Condition: "acute appendicitis"
- Mood: "scheduled for"
- Procedure: "laparoscopic appendicectomy"